尿路感染，最常見的途徑是：
A. 下行性感染
B. 上行性感染
C. 血行性感染
D. 直接接觸感染

正確答案：B. 上行性感染